Clinical trial exclusion criterion:
Wound healing issues at time of possible conversion (eg, wound dehiscence, wound infection, incisional hernia, lymphocele, seroma)

Annotated entities:
- Condition: "Wound healing issues"
- Temporal: "at time of possible conversion"
- Condition: "wound dehiscence"
- Condition: "wound infection"
- Condition: "incisional hernia"
- Condition: "lymphocele"
- Condition: "seroma"